Clinical trial inclusion criterion:
Patients should have been off other investigational antineoplastic therapy for one month prior to entry in this study.

Entity relations:
- Has_negation("antineoplastic therapy", "been off")
- Has_index("for one month prior to entry in this study", "entry in this study")
- Has_temporal("antineoplastic therapy", "for one month prior to entry in this study")